18 歲的女性，主訴從昨天起至今一直有頻尿、尿急和恥骨上方疼痛的現象。她並陳述前三天才第一 次有性經驗，可是她的性伴侶有使用保險套避孕。下列敘述何者正確？
A. 膀胱發炎男人比女人更易發生
B. 導尿之尿液檢查，若發現有細菌或白血球大於 30 顆/HPF，則強烈懷疑其有尿路感染
C. 使用保險套可預防尿路感染
D. 十幾歲的婦女比停經後的婦女更易有無症狀的菌尿症

正確答案：B. 導尿之尿液檢查，若發現有細菌或白血球大於 30 顆/HPF，則強烈懷疑其有尿路感染